Clinical trial exclusion criterion:
Known renal function disorders (MDRD <ô0)

Annotated entities:
- Condition: "renal function disorders"
- Measurement: "MDRD"
- Value: "<ô0"